Physical allergies or cultural objections to porcine products

The above is a clinical trial exclusion criterion. Annotated with entity spans:
[Non-query-able: Physical allergies or cultural objections to porcine products]